A positive result for HLA-B*1301 in those subjects randomised to the genetic screening arm.

The above is a clinical trial exclusion criterion. Annotated with entity spans:
A [Value: positive] result for [Measurement: HLA-B*1301] in those subjects randomised to the genetic screening arm.